可用於鑑別診斷活動量較低之譫妄（delirium）與憂鬱症最佳的檢查為何？
A. 脊椎穿刺脊髓液檢查
B. 腦波
C. 腦部斷層掃描
D. 生化檢查

正確答案：B. 腦波